Subject has known CD and a recent history (within last 2 years) of mucosal disease (diagnosis based on radiologic, endoscopic, or histological evidence).

The above is a clinical trial inclusion criterion. Annotated with entity spans:
Subject has known [Undefined_semantics: CD] and a [Temporal: recent history] ([Temporal: within last 2 years]) of [Condition: mucosal disease] (diagnosis based on [Observation: radiologic], [Observation: endoscopic], or [Observation: histological evidence]).